Clinical trial exclusion criterion:
Anatomical limitations preventing placement of an electrode

Annotated entities:
- Observation: "Anatomical limitations"
- Procedure: "placement of an electrode"
- Negation: "preventing"
- Non-query-able: "Anatomical limitations preventing placement of an electrode"